Clinical trial inclusion criteria:
ASA physical status I-II
age between 18-80 years old
dNMB with rocuronium during ear nose and throat (ENT) surgery

Annotated entities:
- Measurement: "ASA physical status"
- Value: "I-II"
- Person: "age"
- Value: "between 18-80 years"
- Drug: "dNMB with rocuronium"
- Procedure: "ear nose and throat (ENT) surgery"